Participants taking CPI combination therapies with chemotherapy are not permitted.

The above is a clinical trial exclusion criterion. Annotated with entity spans:
Participants taking [Procedure: CPI combination therapies] with [Procedure: chemotherapy] are not permitted.